有關腹膜透析和血液透析的優劣點，下列何者錯誤？
A. 血液透析對於超過濾（ultrafiltration）的控制比較正確
B. 腹膜透析比較容易發生血脂肪升高
C. 血液透析比較常有白蛋白流失
D. 腹膜透析比較容易有低血鉀情況

正確答案：C. 血液透析比較常有白蛋白流失